Clinical trial inclusion criterion:
Those who weigh more than 40kg

Entity relations:
- Has_value("weigh", "more than 40kg")